Clinical trial exclusion criteria:
younger than 18 years old
HBsAg negative at baseline
pregnant or lactating women

Annotated entities:
- Value: "younger than 18 years"
- Person: "old"
- Condition: "HBsAg negative"
- Temporal: "at baseline"
- Condition: "pregnant"
- Condition: "lactating"
- Person: "women"